Take any Alpha-Methyldopa, Clonodine, Other Alpha-2 Adrenergic Agonist

The above is a clinical trial exclusion criterion. Annotated with entity spans:
Take any [Drug: Alpha-Methyldopa], [Drug: Clonodine], [Qualifier: Other] [Drug: Alpha-2 Adrenergic Agonist]